What is the most frequent evolution (next stage) when Aortic intramural hematoma (IMH) is not treated?

Intramural hematoma IMH may progress to classic dissection, frank rupture, or aneurysmal dilation.